Physical impossibility for apply the drug

The above is a clinical trial exclusion criterion. Annotated with entity spans:
[Non-representable: Physical impossibility for apply the drug]